What is the most common pediatric glioma?

Pilocytic astrocytoma is the most common pediatric glioma.